Clinical trial inclusion criteria:
Are negative for human immunodeficiency virus (HIV) infection at screening
Is healthy on the basis of physical examination, medical history, electrocardiogram (ECG), and vital signs measurement performed at screening
Are willing/able to adhere to the prohibitions and restrictions specified in the protocol and study procedures
Female participants of childbearing potential must have a negative serum pregnancy test (beta human chorionic gonadotropin [beta hCG]) at the Screening visit, and a negative urine pregnancy test pre-dose on Day 1
Are assessed by the clinic staff as being at low risk for HIV infection

Annotated entities:
- Condition: "human immunodeficiency virus (HIV)"
- Negation: "negative"
- Temporal: "at screening"
- Condition: "healthy"
- Procedure: "electrocardiogram (ECG)"
- Temporal: "medical history"
- Procedure: "physical examination"
- Procedure: "vital signs measurement"
- Temporal: "at screening"
- Post-eligibility: "Are willing/able to adhere to the prohibitions and restrictions specified in the protocol and study procedures"
- Non-query-able: "Are willing/able to adhere to the prohibitions and restrictions specified in the protocol and study procedures"
- Person: "Female"
- Condition: "childbearing potential"
- Measurement: "serum pregnancy test"
- Value: "negative"
- Measurement: "beta human chorionic gonadotropin [beta hCG]"
- Temporal: "at the Screening visit"
- Reference_point: "Screening visit"
- Measurement: "urine pregnancy test"
- Value: "negative"
- Temporal: "pre-dose on Day 1"
- Reference_point: "Day 1"
- Grammar_Error: "pre-dose"
- Condition: "low risk"
- Condition: "HIV infection"
- Subjective_judgement: "low risk"
- Undefined_semantics: "low risk"